Clinical trial exclusion criterion:
Sensistivity/allergy against anesthetic agents

Entity relations:
- AND("Sensistivity", "anesthetic agents")
- OR("Sensistivity", "allergy")